Clinical trial exclusion criterion:
institutionalized patients; alcohol consumption >60 g/day

Entity relations:
- Has_multiplier("alcohol consumption", ">60 g/day")